Clinical trial exclusion criterion:
Need for dual organ transplant

Annotated entities:
- Measurement: "dual organ transplant"
- Mood: "Need for"